Clinical trial exclusion criterion:
Subjects who have not been weight stable (>2 kg weight change in past 3 months)

Entity relations:
- Has_value("weight change", ">2 kg")
- Has_temporal("weight change", "in past 3 months")
- Has_negation("weight stable", "not")
- Subsumes("weight stable", "weight change")